Clinical trial inclusion criterion:
Serum bilirubin: ≤ 1.2 mg/dL

Entity relations:
- Has_value("Serum bilirubin", "≤ 1.2 mg/dL")